No prior chemotherapy for their metastatic breast cancer (MBC).

The above is a clinical trial inclusion criterion. Annotated with entity spans:
[Negation: No] [Temporal: prior] [Procedure: chemotherapy] for their [Condition: metastatic breast cancer (MBC)].